下列何者在動脈粥狀硬化（atherosclerosis）患者會有增加的現象？①收縮壓（systolic pressure） ②舒張壓（diastolic pressure） ③脈搏壓（pulse pressure） ④動脈順應性（compliance）
A. 僅①②③
B. 僅①③
C. 僅②③
D. ①②③④

正確答案：B. 僅①③